In November 2017,  in what phase  was  the clinical trial for the drug SYL040012?

SYL040012 is in phase 2 clinical trials